Clinical trial exclusion criterion:
History of BCG sepsis

Annotated entities:
- Condition: "BCG"
- Condition: "sepsis"
- Temporal: "History"